La utilización de la técnica estadística de la regresión múltiple permite:
1. Determinar los valores mínimos de la variable dependiente.
2. Establecer qué variables independientes influyen en la variable dependiente.
3. Determinar la importancia de la variable dependiente en la población.
4. Establecer la relación simultánea entre un gran número de variables predictoras.

Respuesta correcta: 2. Establecer qué variables independientes influyen en la variable dependiente.